Age 18-80 years old;

The above is a clinical trial inclusion criterion. Annotated with entity spans:
[Person: Age] [Value: 18-80 years old];